Clinical trial inclusion criterion:
SVD defined on echocardiography by an alteration of bioprosthesis leaflets function with a mean transvalvular gradient > 20 mmHg and maximal velocity = 3 m/s and effective orifice area =1.2 cm², and/or an aortic regurgitation more or equal to grade 2 on 4.

Entity relations:
- Has_value("grade", "more or equal to 2 on 4")
- Has_value("mean transvalvular gradient", "> 20 mmHg")
- Has_value("maximal velocity", "= 3 m/s")
- Has_value("effective orifice area", "=1.2 cm²")
- AND("aortic regurgitation", "grade")
- AND("alteration of bioprosthesis leaflets function", "mean transvalvular gradient")
- AND("SVD", "echocardiography")
- AND("echocardiography", "alteration of bioprosthesis leaflets function")
- AND("alteration of bioprosthesis leaflets function", "maximal velocity")
- AND("alteration of bioprosthesis leaflets function", "effective orifice area")
- OR("alteration of bioprosthesis leaflets function", "aortic regurgitation")